Clinical trial exclusion criterion:
known allergy to any of drugs used

Annotated entities:
- Condition: "allergy"
- Drug: "drugs used"